Clinical trial inclusion criterion:
Has at least one HIV-infected sexual partner for =4 weeks.

Annotated entities:
- Multiplier: "at least one"
- Observation: "sexual partner"
- Condition: "HIV-infected"
- Value: "=4 weeks"